Clinical trial inclusion criterion:
Subject has marked local inflammation

Annotated entities:
- Condition: "local inflammation"
- Qualifier: "marked"